Clinical trial inclusion criteria:
1. Diagnosis of primary immunodeficiency with established plan to undergo myeloablative or non-myeloablative allogeneic hematopoietic stem cell transplant for treatment thereof or diagnosis of a form of primary immunodeficiency for which hematopoietic stem cell transplantation is not indicated.
2. Active infection with EBV, CMV, and/or Adenovirus, unable to be successfully controlled with standard therapy.
3. Steroids less than 0.5 mg/kg/day prednisone
4. Karnofsky/Lansky score of ≥ 50
5. ANC greater than 500/µL.
6. Bilirubin <2x, AST <3x, Serum creatinine <2x upper limit of normal, Hgb >8.0
7. Pulse oximetry of > 90% on room air
8. Negative pregnancy test (if female of childbearing potential)
9. Patient or parent/guardian capable of providing informed consent.

Annotated entities:
- Parsing_Error: "1."
- Condition: "primary immunodeficiency"
- Procedure: "allogeneic hematopoietic stem cell transplant myeloablative"
- Procedure: "non-myeloablative allogeneic hematopoietic stem cell transplant"
- Condition: "primary immunodeficiency"
- Procedure: "hematopoietic stem cell transplantation"
- Negation: "not indicated"
- Parsing_Error: "2."
- Condition: "EBV"
- Condition: "CMV"
- Condition: "Adenovirus"
- Qualifier: "unable to be controlled"
- Procedure: "standard therapy"
- Parsing_Error: "3."
- Drug: "Steroids"
- Multiplier: "less than 0.5 mg/kg/day"
- Drug: "prednisone"
- Parsing_Error: "4."
- Measurement: "Karnofsky/Lansky score"
- Value: "≥ 50"
- Parsing_Error: "5."
- Measurement: "ANC"
- Value: "greater than 500/µL"
- Parsing_Error: "6."
- Measurement: "Bilirubin"
- Value: "<2x"
- Measurement: "AST"
- Value: "<3x"
- Measurement: "Serum creatinine"
- Value: "<2x upper limit of normal"
- Measurement: "Hgb"
- Value: ">8.0"
- Parsing_Error: "7."
- Measurement: "Pulse oximetry on room air"
- Value: "> 90%"
- Parsing_Error: "8."
- Measurement: "pregnancy test"
- Value: "Negative"
- Condition: "childbearing potential"
- Person: "female"
- Parsing_Error: "9."
- Post-eligibility: "Patient or parent/guardian capable of providing informed consent"
- Non-query-able: "Patient or parent/guardian capable of providing informed consent."